inadequate spoken finnish for reliable pain assessment

The above is a clinical trial exclusion criterion. Annotated with entity spans:
[Observation: inadequate spoken finnish] for [Procedure: reliable pain assessment]